Clinical trial exclusion criterion:
cardiac reoperations

Annotated entities:
- Procedure: "cardiac reoperations"